Clinical trial inclusion criterion:
Post menopausal women with a history of estrogen positive breast cancer who are receiving aromatase inhibitors for at least one month.

Annotated entities:
- Condition: "Post menopausal"
- Person: "women"
- Temporal: "history"
- Qualifier: "estrogen positive"
- Condition: "breast cancer"
- Drug: "aromatase inhibitors"
- Temporal: "for at least one month"